一位 24 歲女性，G2P1，妊娠 42 週，待產中胎兒心律發生「變異減速」（variable deceleration），則下列診斷以何者為最可能？
A. 胎頭壓迫
B. 臍帶壓迫
C. 子宮胎盤功能不足
D. 胎兒畸形

正確答案：B. 臍帶壓迫